Clinical trial exclusion criterion:
Subjects with blood disorders.

Annotated entities:
- Condition: "blood disorders"